Clinical trial exclusion criterion:
4. Diseases:

Annotated entities:
- Parsing_Error: "4."
- Parsing_Error: "Diseases:"